一位 36 歲的男性，主訴有下背痛並且會延伸到右小腿的外側，右足部背側有麻木感覺。身體診查發現右側 SLRT（straight leg raising test）在 60 度時就會引起劇痛，且大趾背屈力量為 4 分，初步臨床診斷為椎間盤突出症造成的坐骨神經痛。最可能的病灶為何部位？
A. 第二、三腰椎椎間盤
B. 第三、四腰椎椎間盤
C. 第四、五腰椎椎間盤
D. 第五腰椎、第一薦椎椎間盤

正確答案：C. 第四、五腰椎椎間盤